Clinical trial inclusion criterion:
Breast - Karnofsky score > 50;

Entity relations:
- Has_value("Breast - Karnofsky score", "> 50")